下列有關胰島素的敘述，何者正確？
A. 含有澱粉的食物在經過胃壁時可誘發胰臟分泌胰島素
B. 在肌肉細胞的細胞膜上有胰島素的受器，當胰島素與其受器接合後，可誘發葡萄糖經過細胞膜進入組織間液
C. 胰臟的β細胞可將葡萄糖代謝後，引起胰島素分泌
D. 胰島素受器有 1 個α-subunit 及 2 個β-subunits

正確答案：C. 胰臟的β細胞可將葡萄糖代謝後，引起胰島素分泌